30歲G3P0A3的女性，因為三次小於10週的習慣性流產，和丈夫一同前來求診。她之前做過唯一一次的檢查是自體抗體：lupus anticoagulant陰性，anti-β2-glycoprotein 1 Ab陰性，anticaridiolipin IgG high positive。這對夫妻想知道習慣性流產的原因。下列何項建議最不適合？
A. 告知太太有抗磷脂質症候群（antiphospholipid syndrome），應立即開始服用aspirin
B. 安排經陰道超音波、子宮輸卵管攝影或子宮腔鏡
C. 抽血檢查甲狀腺功能
D. 12週後再追蹤一次自體抗體濃度

正確答案：A. 告知太太有抗磷脂質症候群（antiphospholipid syndrome），應立即開始服用aspirin